Clinical trial exclusion criterion:
Central nervous system (CNS) metastases or prior radiation for CNS metastases

Annotated entities:
- Condition: "Central nervous system (CNS) metastases"
- Procedure: "radiation"
- Condition: "CNS metastases"